43 歲男性，因腹脹至醫院求診，腹部超音波檢查顯示有腹水。腹水檢查之 albumin 值為 2.4 g/dL，血中 albumin 值為 3.5 g/dL，則下列診斷何者最不可能？
A. tuberculosis
B. pancreatitis
C. liver cirrhosis
D. peritoneal carcinomatosis

正確答案：C. liver cirrhosis